Subject unwilling to cease use of any treatment for erectile dysfunction during the study, including oral medication, vacuum devices, constrictive devices, injections, urethral suppositories, gels, any over-the-counter or nonprescription medications, and products purchased via the internet

The above is a clinical trial exclusion criterion. Annotated with entity spans:
Subject [Negation: unwilling] to [Mood: cease use of] any [Procedure: treatment] for [Condition: erectile dysfunction] [Temporal: during the study], including [Procedure: oral medication], [Device: vacuum devices], [Device: constrictive devices], [Procedure: injections], [Device: urethral suppositories], [Procedure: gels], any [Qualifier: over-the-counter] or [Qualifier: nonprescription] [Procedure: medications], and products purchased via the internet